一位 6 歲兒童因為發燒、咽部痛、咳嗽、流鼻水持續 4 天就診，身體檢查發現咽部輕度發紅，肺部與心臟聽診正常，無其他異常徵候。血液檢查白血球 4,300/mm3，segment 56%，lymphocyte 41%， monocyte 3%。其父親與母親於病童就診前一天也有發燒現象，並有肌肉酸痛症狀。下列那一項是這位兒童最可能罹患的疾病？
A. 流感病毒感染
B. 腺病毒感染
C. 敗血症
D. 腸病毒感染

正確答案：A. 流感病毒感染